Clinical trial exclusion criterion:
Patients with history of chronic liver disease, cancer or connective tissue disorders.

Annotated entities:
- Condition: "chronic liver disease"
- Condition: "cancer"
- Condition: "connective tissue disorders"
- Temporal: "history"